下列病變中，何者與主動脈剝離（aortic dissection）最相關？
A. 梅毒性主動脈炎（syphilitic aortitis）
B. 囊狀中膜壞死（cystic medial necrosis）
C. 分枝桿菌性主動脈炎（mycobacterial aortitis）
D. 鏈球菌性心內膜炎併主動脈炎（streptococcal endocarditis with aortitis）

正確答案：B. 囊狀中膜壞死（cystic medial necrosis）